Simultaneous participation in another intervention trial

The above is a clinical trial exclusion criterion. Annotated with entity spans:
[Context_Error: Simultaneous participation in another intervention trial]